Clinical trial inclusion criteria:
Pregnant
American Society of Anesthesiologists risk classification I and II
Age > 18 years
Non-laboring
Patients with elective cesarean sections

Annotated entities:
- Condition: "Pregnant"
- Measurement: "American Society of Anesthesiologists risk classification"
- Value: "I and II"
- Person: "Age"
- Value: "> 18 years"
- Value: "Non-laboring"
- Qualifier: "elective"
- Procedure: "cesarean sections"